Clinical trial exclusion criterion:
Complicated (effusion, empyema or abscess) pneumonia, including tuberculosis

Annotated entities:
- Condition: "Complicated pneumonia"
- Condition: "tuberculosis"
- Condition: "effusion"
- Condition: "empyema"
- Condition: "abscess"